Clinical trial exclusion criterion:
Bypass graft lesion

Entity relations:
- AND("lesion", "Bypass graft")